What is the cyberknife used for?

CyberKnife(r) is a robotic stereotactic radiotherapy system